Clinical trial inclusion criterion:
Male and female patients between the ages of 18-65 years, inclusive

Entity relations:
- Has_value("ages", "18-65 years")
- OR("Male", "female")